Clinical trial exclusion criterion:
History of severe psychiatric disease, especially depression. Severe psychiatric disease is defined as major depression or psychosis, a period of treatment with an antidepressant medication or major tranquilizer at therapeutic doses for depression or psychosis for at least 3 months, a suicidal attempt, hospitalization for psychiatric disease, or a period of disability due to a psychiatric disease.

Entity relations:
- Has_qualifier("psychiatric disease", "severe")
- Subsumes("psychiatric disease", "depression")
- AND("hospitalization", "psychiatric disease")
- AND("disability", "psychiatric disease")
- Has_multiplier("antidepressant medication", "therapeutic doses")
- Has_temporal("psychosis", "for at least 3 months")
- AND("treatment", "antidepressant medication")
- AND("treatment", "depression")
- Subsumes("Severe", "major depression")
- Subsumes("psychiatric disease", "Severe")
- OR("antidepressant medication", "major tranquilizer")
- OR("major depression", "disability", "hospitalization", "suicidal attempt", "psychosis", "treatment", "psychosis")
- OR("Severe", "psychiatric disease")